Patients with peripheral neuropathy

The above is a clinical trial exclusion criterion. Annotated with entity spans:
Patients with [Condition: peripheral neuropathy]